Andexanet Alfa is an antidote of which clotting factor inhibitors?

Andexanet alfa is a class-specific antidote targeted to reverse the oral direct factor Xa inhibitors as well as the indirect inhibitor, enoxaparin.